New York Heart Association class II-IV symptoms

The above is a clinical trial inclusion criterion. Annotated with entity spans:
[Measurement: New York Heart Association] [Value: class II-IV] [Condition: symptoms]